List the blood group antigens, associated with blood type

The blood group antigens, associated with blood type, are: ab, von willebrand factor, o, a, de ritis, rhesus, b, factor viii, rresus d, platelets and abo.